Clinical trial inclusion criterion:
Documentation the subject not effectively treated with CPAP therapy. (Examples include non-compliance, discomfort, undesirable side effects, symptoms persist despite use). Subjects who have been prescribed, but refuse to try CPAP would be considered intolerant.

Annotated entities:
- Negation: "not"
- Procedure: "CPAP therapy"